La “visión en túnel” es un fenómeno que la psicología cognitiva atribuye al papel que cumple la atención como:
1. Selección.
2. Activación.
3. Concentración.
4. Vigilancia.
5. Expectativa.

Respuesta correcta: 2. Activación.